No major surgery requiring general anaesthesia for at least 3 months prior to the screening visit.

The above is a clinical trial exclusion criterion. Annotated with entity spans:
[Negation: No] [Condition: major surgery] requiring [Procedure: general anaesthesia] [Temporal: for at least 3 months prior to the screening visit].